Unable to comprehend consent material because of language barrier or psychological difficulty

The above is a clinical trial exclusion criterion. Annotated with entity spans:
[Post-eligibility: Unable to comprehend consent material because of language barrier or psychological difficulty]